Subjects who have human Immunodeficiency virus (HIV), hepatitis B virus (HBV), and hepatitis C virus (HCV)

The above is a clinical trial exclusion criterion. Annotated with entity spans:
Subjects who have [Condition: human Immunodeficiency virus (HIV)], [Condition: hepatitis B virus (HBV)], [Grammar_Error: and] [Condition: hepatitis C virus (HCV)]